Cardiac surgery already scheduled in the next three months

The above is a clinical trial exclusion criterion. Annotated with entity spans:
[Procedure: Cardiac surgery] already [Mood: scheduled] [Temporal: in the next three months]